Clinical trial inclusion criterion:
Patient who have signed the consent form

Annotated entities:
- Post-eligibility: "Patient who have signed the consent form"
- Context_Error: "Patient who have signed the consent form"
- Non-query-able: "Patient who have signed the consent form"